Which symptoms comprise Abdominal aortic aneurysm rupture Triad?

Classic triad of Abdominal aortic aneurysm rupture include shock, acute abdominal pain, and pulsatile abdominal mass.